Clinical trial exclusion criteria:
Columbia-Suicide Severity Rating Scale (C-SSRS) for suicidal ideation and behavior in past year.
Hypersensitivity to morphine, naltrexone.
A life expectancy (assessed by investigator) of less than 6 months or is no longer capable of taking medication orally.
Undergone surgery within 3 days prior to the first day of dosing.

Annotated entities:
- Measurement: "Columbia-Suicide Severity Rating Scale"
- Measurement: "C-SSRS"
- Condition: "suicidal ideation"
- Condition: "suicidal behavior"
- Temporal: "in past year"
- Condition: "Hypersensitivity"
- Drug: "morphine"
- Drug: "naltrexone"
- Observation: "life expectancy"
- Value: "less than 6 months"
- Non-query-able: "is no longer capable of taking medication orally"
- Procedure: "surgery"
- Temporal: "within 3 days prior to the first day of dosing"
- Reference_point: "first day of dosing"